一位 3 歲男童因為持續咳嗽 3 週與發燒 1 週就診，有時會因為劇烈咳嗽而引起嘔吐，身體檢查發現右側結膜炎並有些分泌物，肺部聽診雙側有細囉音（fine crackles）。下列那一項是最可能的病原？
A. 流感
B. 百日咳
C. 黴漿菌
D. 腺病毒

正確答案：D. 腺病毒